acute or unstable medical disease,

The above is a clinical trial exclusion criterion. Annotated with entity spans:
[Qualifier: acute] or [Qualifier: unstable] [Condition: medical disease],